Clinical trial exclusion criterion:
Women with systemic lupus erythematosus (SLE)

Annotated entities:
- Person: "Women"
- Condition: "systemic lupus erythematosus (SLE)"